Clinical trial inclusion criterion:
Successful cardiac ablation for AF

Entity relations:
- Has_qualifier("cardiac ablation", "Successful")
- AND("cardiac ablation", "AF")